14 歲大之女孩主訴過去兩週以來黃疸愈來愈深，理學檢查並無肝脾腫大。下列何項檢查結果最可能讓你診斷她有猛爆性肝衰竭，而建議立即作肝臟移植？
A. 血氨升高
B. 給予維生素 K 後，前凝血酶原時間（prothrombin time）仍持續延長
C. 血清直接型膽紅素及 ALT 值越來越高
D. 出現腹水

正確答案：B. 給予維生素 K 後，前凝血酶原時間（prothrombin time）仍持續延長